Patient currently included in a study of varicose vein treatment

The above is a clinical trial exclusion criterion. Annotated with entity spans:
[Competing_trial: Patient currently included in a study of varicose vein treatment]